Note: Unit of randomization is the hospital, but the participants are hospital adult ICUs

The above is a clinical trial inclusion criterion. Annotated with entity spans:
[Non-representable: Note: Unit of randomization is the hospital, but the participants are hospital adult ICUs]